What is Aortitis?

Aortitis is inflammation of the aorta due to various causes. It can be caused by an underlying infectious or non-infectious disease process.